Clinical trial exclusion criterion:
Malignancy and other significant medical conditions that will impact follow up within this program.

Entity relations:
- Has_qualifier("medical conditions", "significant")
- OR("Malignancy", "medical conditions")